Clinical trial inclusion criterion:
Has a Child-Pugh A liver score within 7 days prior to first dose of study medication

Entity relations:
- Has_value("Child-Pugh liver score", "A")
- Has_index("within 7 days prior", "first dose of study medication")
- Has_temporal("Child-Pugh liver score", "within 7 days prior")